下列敘述何者為使用肥大細胞安定劑（mast cell stabilizer）眼藥水治療過敏性結膜炎的缺點？
A. 必須在全然發作前就開始使用
B. 每小時要點一次
C. 容易引起氣喘發作
D. 容易引起青光眼發作

正確答案：A. 必須在全然發作前就開始使用